Vancomycin為methicillin-resistant staphylococcal infection（MRSI）之首選用藥，制菌機轉與下列何者有關，進而抑制細菌之細胞壁生成？
A. 抑制細菌之transpeptidase
B. 和細菌細胞壁成分胜肽醣酐鍊（peptidoglycan）上之D-alanin-D-alanin（D-Ala-D-Ala）緊密結合
C. 抑制合成細胞壁所需原料D-Ala之生成
D. 抑制細胞膜上脂溶性載體bactoprenol之去磷酸化作用

正確答案：B. 和細菌細胞壁成分胜肽醣酐鍊（peptidoglycan）上之D-alanin-D-alanin（D-Ala-D-Ala）緊密結合